Clinical trial exclusion criterion:
Current pregnancy as assessed by preoperative urine HCG test

Annotated entities:
- Temporal: "preoperative"
- Measurement: "urine HCG test"
- Value: "pregnancy"
- Condition: "pregnancy"